What tissue is commonly affected in Marfan's syndrome

Marfan syndrome (MS) is a connective tissue disorder that affects thousands of adolescents